Use of monoamine oxidase inhibitors 21 days prior to study

The above is a clinical trial exclusion criterion. Annotated with entity spans:
Use of [Drug: monoamine oxidase inhibitors] [Temporal: 21 days prior to study]